下列有關蜱媒介人畜共通萊姆病（Lyme disease）之敘述，何者錯誤？
A. 高度流行區內常有共同感染（co-infection）巴貝氏原蟲（Babesia spp.）
B. 其致病原為伯氏疏螺旋體（Borrelia burgdorferi）
C. 感染早期以遊走性紅斑（erythema migrans）為主要病癥
D. 人類感染之早期診斷以血液抹片鏡檢為主

正確答案：D. 人類感染之早期診斷以血液抹片鏡檢為主